Clinical trial inclusion criterion:
Hemoglobin level of 7.0 g/dL or greater

Annotated entities:
- Measurement: "Hemoglobin level"
- Value: "7.0 g/dL or greater"